Clinical trial exclusion criterion:
Severe gastroesophageal reflux disease

Annotated entities:
- Condition: "gastroesophageal reflux disease"
- Qualifier: "Severe"